Clinical trial exclusion criterion:
Pregnancy;

Annotated entities:
- Condition: "Pregnancy"